Clinical trial inclusion criterion:
Age 19 years of older

Annotated entities:
- Person: "Age"
- Value: "19 years of older"